What is the role of the histidine rich calcium binding protein (HRC) in cardiomyopathy?

The histidine-rich Ca-binding protein (HRC), a 165 kDa sarcoplasmic reticulum (SR) protein, regulates SR Ca cycling during excitation–contraction coupling.  HRC mutations or polymorphisms lead to cardiac dysfunction.  The Ser96Ala genetic variant of HRC is associated with life-threatening ventricular arrhythmias and sudden death in idiopathic dilated cardiomyopathy (DCM).